Clinical trial exclusion criteria:
Severe deformity (varus or values from mechanical axis more than 5 degrees
Allergy to hyaluronic acid
Pain on hip or ankle
Post-traumatic or post surgery of lower extremity
Post infection of knee
Previous hyaluronic acid injection within 6 months
Pregnancy or lactation
Underlying Rheumatoid arthritis, stroke, malignancy, venous occlusion

Annotated entities:
- Qualifier: "Severe"
- Condition: "deformity"
- Condition: "varus"
- Measurement: "values from mechanical axis"
- Value: "more than 5 degrees"
- Condition: "Allergy"
- Drug: "hyaluronic acid"
- Condition: "Pain"
- Qualifier: "hip"
- Qualifier: "ankle"
- Temporal: "Post-traumatic of lower extremity"
- Temporal: "post surgery of lower extremity"
- Condition: "infection of knee"
- Temporal: "Post"
- Drug: "hyaluronic acid"
- Procedure: "hyaluronic acid injection"
- Temporal: "within 6 months"
- Temporal: "Previous"
- Condition: "Pregnancy"
- Condition: "lactation"
- Condition: "Rheumatoid arthritis"
- Condition: "stroke"
- Condition: "malignancy"
- Condition: "venous occlusion"
- Qualifier: "Underlying"